慢性阻塞性肺疾患者（COPD）使用 O2的好處，不包括下列何者？
A. 增加運動耐力
B. 延長生命
C. 改善肺活量
D. 降低肺門高血壓（pulmonary hypertension）

正確答案：C. 改善肺活量